Clinical trial exclusion criterion:
Active bleeding or at high risk for bleeding.

Annotated entities:
- Qualifier: "Active"
- Condition: "bleeding"
- Mood: "at high risk for"
- Condition: "bleeding"